Clinical trial inclusion criterion:
Having received standard HF therapy for at least 2 weeks, having reached target dose or max tolerable dose.

Entity relations:
- Has_temporal("standard HF therapy", "for at least 2 weeks")
- Has_multiplier("standard HF therapy", "target dose")
- OR("target dose", "max tolerable dose")